Clinical trial inclusion criteria:
Male and female individuals between ages of 18 to 70 years old
Multiple contiguous gingival recession defects on a minimum of two adjacent teeth, exhibiting 3mm or more recession on at least one of those teeth
No prior surgical treatment in the sites planned for therapy
Minimum of 2 mm of keratinized gingiva
Absence of cervical restorations extending to the CEJ
Miller class 1, 2 and 3 recession defects will be included
Availability to undergo treatment and return for follow up visits at specified post-operative intervals

Annotated entities:
- Person: "ages"
- Value: "between 18 to 70 years old"
- Condition: "gingival recession defects"
- Multiplier: "Multiple"
- Multiplier: "minimum of two"
- Value: "3mm or more"
- Measurement: "recession"
- Multiplier: "at least one"
- Procedure: "surgical treatment"
- Negation: "No"
- Non-query-able: "No prior surgical treatment in the sites planned for therapy"
- Value: "Minimum of 2 mm"
- Measurement: "keratinized gingiva"
- Observation: "cervical restorations extending to the CEJ"
- Negation: "Absence"
- Measurement: "Miller"
- Condition: "recession defects"
- Value: "class 1, 2 and 3"
- Non-query-able: "Availability to undergo treatment and return for follow up visits at specified post-operative intervals"